Why is the Fyn kinase considered a promising therapeutic target for Alzheimer's Disease?

Fyn is an attractive target for AD therapeutics, not only based on its activation by Aβ via cellular prion protein but also due to its known interaction with tau, uniquely linking the two key pathologies in AD.